CHF, angina or arrhythmias

The above is a clinical trial exclusion criterion. Annotated with entity spans:
[Condition: CHF], [Condition: angina] or [Condition: arrhythmias]